Clinical trial exclusion criteria:
Participation in the 4 weeks preceding inclusion or planned participation during the present trial period in another clinical trial investigating a vaccine, drug, medical device, or medical procedure.
Receipt of any vaccine in the 4 weeks preceding each trial vaccination or planned receipt of any vaccine in the 4 weeks following each trial vaccination, except for:
(i) influenza vaccination, which may be received at least 2 weeks before study vaccines.
(ii) measles (M) or measles, mumps, rubella (MMR) routine vaccination, which can be administered concomitantly with the first dose of study vaccine as per routine immunization schedule
(iii) for subjects enrolled at Indian sites: oral poliomyelitis vaccine (OPV) received during National Immunization Days (NIDs) and supplementary immunization activity days (SIADs)
Previous vaccination against meningococcal disease with either the study vaccine or another meningococcal vaccine
Receipt of immune globulins, blood or blood-derived products in the past 3 months
Known or suspected congenital or acquired immunodeficiency; or receipt of immunosuppressive therapy, such as anti-cancer chemotherapy or radiation therapy, within the preceding 6 months; or long-term systemic corticosteroid therapy (prednisone or equivalent for more than 2 consecutive weeks within the past 3 months)
History of meningococcal diseases, confirmed either clinically, serologically, or microbiologically
At high risk, in the opinion of the Investigator, for meningococcal disease during the trial
Known or suspected systemic hypersensitivity to any of the vaccine components, or history of a life-threatening reaction to the vaccine used in the trial or to a vaccine containing any of the same substances
Known thrombocytopenia, contraindicating intramuscular vaccination
Bleeding disorder, or receipt of anticoagulants in the 3 weeks preceding inclusion, contraindicating intramuscular vaccination
In an emergency setting, or hospitalized involuntarily
Chronic illness that, in the opinion of the investigator, is at a stage where it might interfere with trial conduct or completion
For subjects enrolled at Indian sites: Moderate or severe acute illness/infection (according to investigator judgment) on the day of vaccination or febrile illness (temperature ≥ 38.0°C).
For subjects enrolled at Russian sites: Acute disease of any severity on the day of vaccination or febrile illness (axillary temperature ≥ 37.0°C).
A prospective subject should not be included in the study until the condition has resolved or the febrile event has subsided.
Receipt of oral or injectable antibiotic therapy within 72 hours prior to the first blood draw
Identified as a natural or adopted child of the Investigator or employee with direct involvement in the proposed study
Personal history of Guillain-Barré Syndrome.

Annotated entities:
- Temporal: "4 weeks preceding inclusion"
- Reference_point: "inclusion"
- Mood: "planned participation"
- Context_Error: "Participation in the 4 weeks preceding inclusion or planned participation during the present trial period in another clinical trial investigating a vaccine, drug, medical device, or medical procedure."
- Post-eligibility: "Participation in the 4 weeks preceding inclusion or planned participation during the present trial period in another clinical trial investigating a vaccine, drug, medical device, or medical procedure."
- Drug: "vaccine"
- Temporal: "in the 4 weeks preceding each trial vaccination"
- Reference_point: "each trial vaccination"
- Temporal: "in the 4 weeks following each trial vaccination"
- Reference_point: "each trial vaccination"
- Mood: "planned receipt"
- Drug: "vaccine"
- Parsing_Error: "except for:"
- Negation: "except for"
- Drug: "influenza vaccination"
- Temporal: "at least 2 weeks before study vaccines"
- Reference_point: "study vaccines"
- Procedure: "measles (M) vaccination"
- Procedure: "measles, mumps, rubella (MMR) vaccination"
- Temporal: "concomitantly with the first dose of study vaccine"
- Reference_point: "the first dose of study vaccine"
- Visit: "Indian sites"
- Drug: "oral poliomyelitis vaccine (OPV)"
- Temporal: "during National Immunization Days (NIDs)"
- Reference_point: "National Immunization Days (NIDs)"
- Temporal: "during supplementary immunization activity days (SIADs)"
- Reference_point: "supplementary immunization activity days (SIADs)"
- Procedure: "vaccination against meningococcal disease"
- Drug: "study vaccine"
- Drug: "another meningococcal vaccine"
- Drug: "immune globulins"
- Drug: "blood"
- Drug: "blood-derived products"
- Temporal: "in the past 3 months"
- Condition: "acquired immunodeficiency"
- Condition: "congenital immunodeficiency"
- Procedure: "immunosuppressive therapy"
- Procedure: "anti-cancer chemotherapy"
- Procedure: "radiation therapy"
- Temporal: "within the preceding 6 months"
- Procedure: "systemic corticosteroid therapy"
- Multiplier: "long-term"
- Drug: "prednisone"
- Temporal: "for more than 2 consecutive weeks"
- Temporal: "within the past 3 months"
- Observation: "suspected"
- Observation: "Known"
- Condition: "meningococcal diseases"
- Procedure: "serologically"
- Procedure: "microbiologically"
- Value: "confirmed"
- Non-query-able: "At high risk, in the opinion of the Investigator, for meningococcal disease during the trial"
- Subjective_judgement: "At high risk, in the opinion of the Investigator, for meningococcal disease during the trial"
- Condition: "systemic hypersensitivity"
- Drug: "vaccine components"
- Temporal: "history"
- Condition: "life-threatening reaction"
- Drug: "vaccine"
- Drug: "vaccine"
- Qualifier: "used in the trial"
- Context_Error: "used in the trial"
- Context_Error: "Known or suspected systemic hypersensitivity to any of the vaccine components, or history of a life-threatening reaction to the vaccine used in the trial or to a vaccine containing any of the same substances"
- Condition: "thrombocytopenia"
- Condition: "contraindicating"
- Procedure: "intramuscular vaccination"
- Condition: "Bleeding disorder"
- Drug: "anticoagulants"
- Temporal: "in the 3 weeks preceding inclusion"
- Reference_point: "inclusion"
- Condition: "contraindicating"
- Procedure: "intramuscular vaccination"
- Visit: "emergency setting"
- Procedure: "hospitalized"
- Qualifier: "involuntarily"
- Condition: "hospitalized involuntarily"
- Subjective_judgement: "Chronic illness that, in the opinion of the investigator, is at a stage where it might interfere with trial conduct or completion"
- Visit: "Indian sites"
- Qualifier: "Moderate"
- Qualifier: "severe"
- Condition: "acute illness"
- Condition: "acute infection"
- Subjective_judgement: "according to investigator judgment"
- Temporal: "on the day of vaccination"
- Reference_point: "the day of vaccination"
- Condition: "febrile illness"
- Measurement: "temperature"
- Value: "≥ 38.0°C"
- Visit: "Russian sites"
- Condition: "Acute disease"
- Temporal: "on the day of vaccination"
- Reference_point: "the day of vaccination"
- Condition: "febrile illness"
- Measurement: "axillary temperature"
- Value: "≥ 37.0°C"
- Non-query-able: "A prospective subject should not be included in the study until the condition has resolved or the febrile event has subsided."
- Not_a_criteria: "A prospective subject should not be included in the study until the condition has resolved or the febrile event has subsided."
- Drug: "antibiotic therapy"
- Qualifier: "injectable"
- Qualifier: "oral"
- Temporal: "within 72 hours prior to the first blood draw"
- Reference_point: "the first blood draw"
- Non-query-able: "Identified as a natural or adopted child of the Investigator or employee with direct involvement in the proposed study"
- Condition: "Guillain-Barré Syndrome"
- Temporal: "history"